Clinical trial exclusion criterion:
Medical or anatomic contraindication to supraclavicular blockade as judged by clinician

Annotated entities:
- Qualifier: "anatomic"
- Qualifier: "Medical"
- Condition: "contraindication"
- Procedure: "supraclavicular blockade"
- Non-representable: "as judged by clinician"